Clinical trial inclusion criteria:
Histopathological verification of glioblastoma multiforme (GBM: WHO grade IV) in remission (Group A) or with active disease (Group B).
CMV-positive GBM
CMV seropositive
Life expectancy 6 weeks or greater
Karnofsky/Lansky score 50 or greater
Patient or parent/guardian capable of providing informed consent
Bilirubin less than 1.5x upper limit of normal, AST less than 3x upper limit of normal, serum creatinine less than 1.5x normal and Hgb 8.0 g/dL or greater
Pulse oximetry of 90% or greater on room air
Sexually active patients must be willing to utilize one of the more effective birth control methods for 6 months after the CTL infusion. The male partner should use a condom.
Patients should have been off other investigational antineoplastic therapy for one month prior to entry in this study.
Informed consent explained to, understood by and signed by patient/guardian. Patient/guardian given copy of informed consent.

Annotated entities:
- Condition: "glioblastoma multiforme"
- Procedure: "Histopathological"
- Observation: "Histopathological verification"
- Measurement: "WHO"
- Value: "grade IV"
- Qualifier: "in remission"
- Qualifier: "Group A"
- Qualifier: "Group B"
- Temporal: "active"
- Qualifier: "with active disease"
- Condition: "GBM"
- Qualifier: "CMV-positive"
- Condition: "GBM"
- Condition: "CMV"
- Condition: "CMV seropositive"
- Observation: "Life expectancy"
- Value: "6 weeks or greater"
- Measurement: "Karnofsky/Lansky"
- Value: "score 50 or greater"
- Post-eligibility: "Patient or parent/guardian capable of providing informed consent"
- Measurement: "Bilirubin"
- Value: "less than 1.5x upper limit of normal"
- Measurement: "AST"
- Value: "less than 3x upper limit of normal"
- Measurement: "Pulse oximetry"
- Value: "90% or greater"
- Qualifier: "on room air"
- Pregnancy_considerations: "Sexually active patients must be willing to utilize one of the more effective birth control methods for 6 months after the CTL infusion. The male partner should use a condom."
- Post-eligibility: "Patients should have been off other investigational antineoplastic therapy for one month prior to entry in this study."
- Procedure: "antineoplastic therapy"
- Negation: "been off"
- Temporal: "for one month prior to entry in this study"
- Reference_point: "entry in this study"
- Post-eligibility: "Informed consent explained to, understood by and signed by patient/guardian. Patient/guardian given copy of informed consent."